Clinical trial inclusion criterion:
Lack of sensitization (i.e. PRA < 20%) that would be expected to result in a high likelihood of needing aggressive immunosuppression to treat rejection

Entity relations:
- Has_value("PRA", "< 20%")
- AND("sensitization", "PRA")
- Has_negation("sensitization", "Lack of")